Clinical trial exclusion criterion:
uncontrolled asthma, or

Annotated entities:
- Condition: "asthma"
- Qualifier: "uncontrolled"